Clinical trial exclusion criterion:
Failure to record HA data for at least 80% of days during the Screening Period

Annotated entities:
- Observation: "Failure to record HA data"
- Multiplier: "for at least 80% of days"
- Temporal: "during the Screening Period"